Subjects who, in the opinion of the investigator, are unlikely to cooperate fully during the study

The above is a clinical trial exclusion criterion. Annotated with entity spans:
[Non-query-able: Subjects who, in the opinion of the investigator, are unlikely to cooperate fully during the study]